關於癌症病人的惡體質（cachexia），下列何者為最可能之原因？①TNF produced by macrophages ②TNF produced by tumor cells ③IL-10 produced by macrophages ④IL-10 produced by tumor cells
A. ①②
B. ②③
C. ①④
D. ③④

正確答案：A. ①②